下列那種局部麻醉劑（Local anesthetics）不屬於 Amides 類？
A. Bupivacaine
B. Tetracaine
C. Lidocaine
D. Prilocaine

正確答案：B. Tetracaine